有關松果體（pineal gland），下列敘述何項錯誤？
A. 分泌褪黑激素（melatonin）進而影響生殖系統之功能
B. 成人松果體常含有腦沙（corpora arenacea / brain sand）
C. 此腺體包含很多黑色素細胞（melanocyte）
D. 此腺體之活性（activity）受光線（light）影響

正確答案：C. 此腺體包含很多黑色素細胞（melanocyte）